Clinical trial inclusion criterion:
Estimated gestational age greater than 20 weeks

Annotated entities:
- Measurement: "Estimated gestational age"
- Value: "greater than 20 weeks"